Clinical trial exclusion criterion:
Ongoing epilepsy or other seizure disorder, or use of medications for a seizure disorder within 6 months of screening or any time between screening and randomization

Entity relations:
- Has_temporal("epilepsy", "Ongoing")
- multi("Ongoing", "Ongoing")
- Has_qualifier("seizure disorder", "other")
- Has_index("within 6 months of screening", "screening")
- AND("seizure disorder", "medications")
- Has_index("any time between screening and randomization", "screening")
- Has_index("any time between screening and randomization", "randomization")
- Has_temporal("seizure disorder", "within 6 months of screening")
- Has_temporal("seizure disorder", "any time between screening and randomization")
- OR("epilepsy", "seizure disorder", "seizure disorder")